No contraception.

The above is a clinical trial exclusion criterion. Annotated with entity spans:
[Negation: No] [Procedure: contraception].